a history of use of alpha 2 receptor agonists or antagonists.

The above is a clinical trial exclusion criterion. Annotated with entity spans:
a [Temporal: history] of use of [Drug: alpha 2 receptor agonists] or antagonists.